willingness to wear the insulin pump

The above is a clinical trial inclusion criterion. Annotated with entity spans:
[Mood: willingness] to [Procedure: wear the insulin pump]